有關眼球之角膜（cornea），下列敘述何項錯誤？
A. 角膜不具有神經末梢（nerve ending）
B. 角膜的所有代謝交換（metabolic exchange）主要發生於角膜內皮（corneal endothelium）
C. 角膜包括五層結構，其中 Descemet's membrane 與 Bowman's membrane 屬於非細胞層
D. 角膜上皮（corneal epithelium）細胞具有很高之再生能力（regenerative capacity）

正確答案：A. 角膜不具有神經末梢（nerve ending）